Clinical trial exclusion criterion:
Antibiotics within 72 h

Annotated entities:
- Drug: "Antibiotics"
- Temporal: "within 72 h"